obviously poor compliance.

The above is a clinical trial exclusion criterion. Annotated with entity spans:
[Qualifier: obviously] [Observation: poor compliance].